下列何者與急性胰臟炎發生比較無關？
A. 膽道結石
B. 高血脂
C. 酗酒
D. 高血壓

正確答案：D. 高血壓